Clinical trial inclusion criterion:
Newly dignosised type 2 diabetes according to WHO criteria.glycated hemoglobin (HbA1c) was more than 10%;

Annotated entities:
- Temporal: "Newly dignosised"
- Condition: "type 2 diabetes"
- Qualifier: "WHO criteria"
- Measurement: "glycated hemoglobin (HbA1c)"
- Value: "more than 10%"